下列對於疼痛所使用的名詞定義，何者錯誤？
A. hyperalgesia：對疼痛刺激之過度敏感
B. dysesthesia：不悅之異常感覺
C. hypalgesia：對疼痛之敏感度增加
D. allodynia：對外來非引起疼痛的刺激，產生疼痛感

正確答案：C. hypalgesia：對疼痛之敏感度增加